9. Severe hepatic and renal insufficiency (serum creatinine>2.0 mg /dl, AST or ALT is five times higher than the upper limit of normal range);

The above is a clinical trial exclusion criterion. Annotated with entity spans:
9. Severe [Condition: hepatic] and [Condition: renal insufficiency] ([Measurement: serum creatinine][Value: >2.0 mg /dl], [Measurement: AST] or [Measurement: ALT] is [Value: five times higher than the upper limit of normal range]);